一位患有重症肌無力（myasthenia gravis）的孕婦，剛剛平安產下3100公克的小女嬰，但是隨即發現小女嬰呼吸較淺，四肢力量也較差，因此迅速被送入新生兒加護病房治療。小女嬰的病因為何？
A. 母親傳給她的抗乙醯膽鹼受體抗體（anti-acetylcholine receptor antibody）致病
B. 母親的TR1細胞（TR1 cells）引起之免疫反應
C. 母親的TH3細胞（TH3 cells）引起之免疫反應
D. 母親傳給她的抗Ro抗體（anti-Ro antibody）及抗La抗體（anti-La antibody）所致病

正確答案：A. 母親傳給她的抗乙醯膽鹼受體抗體（anti-acetylcholine receptor antibody）致病